mRNA 的前驅物是必須經由下列何項來剪接掉其 intron？
A. 是自己剪接不靠其它因子
B. 由 spliceosome 來執行
C. 由 RNA polymerase 來控制
D. 由 RNA helicase 來控制

正確答案：B. 由 spliceosome 來執行